Clinical trial exclusion criterion:
On any thoracic surgery waiting list.

Entity relations:
- AND("thoracic surgery waiting list", "thoracic surgery")